Clinical trial exclusion criterion:
Cardiovascular disease Clinically relevant ventricular tachycardia or ventricular fibrillation, 3rd degree AV block or Torsades de Pointes or treatment with antiarrhythmic drugs. Percutaneous coronary intervention within the past 6 months. Any of the following within the past 6 months: myocardial infarction (MI), coronary artery bypass surgery; unstable angina; or stroke.

Annotated entities:
- Condition: "Cardiovascular disease"
- Qualifier: "Clinically relevant"
- Condition: "ventricular tachycardia"
- Condition: "ventricular fibrillation"
- Condition: "3rd degree AV block"
- Condition: "Torsades de Pointes"
- Procedure: "treatment"
- Drug: "antiarrhythmic drugs"
- Procedure: "Percutaneous coronary intervention"
- Temporal: "within the past 6 months"
- Temporal: "within the past 6 months"
- Condition: "myocardial infarction (MI)"
- Procedure: "coronary artery bypass surgery"
- Condition: "unstable angina"
- Condition: "stroke"